Patients with Guillain-Barré syndrome radiculopathy of vascular origin.

The above is a clinical trial exclusion criterion. Annotated with entity spans:
Patients with [Condition: Guillain-Barré syndrome radiculopathy] of [Qualifier: vascular] origin.